Clinical trial exclusion criterion:
Serum total bilirubin > 3 times the upper limit of normal at screening.

Annotated entities:
- Measurement: "Serum total bilirubin"
- Value: "> 3 times the upper limit of normal"
- Temporal: "at screening"